下列何者比較不會形成連續性心雜音（continuous murmur）？
A. 開放性動脈導管（patent ductus arteriosus）
B. 接受 Blalock-Taussing shunt 術後
C. Ebstein 三尖瓣膜異常
D. 冠狀動靜脈廔管（coronary AV fistula）

正確答案：C. Ebstein 三尖瓣膜異常